肺小細胞癌之特徵，與下列那一項最無關？
A. 可能分泌ACTH
B. 形成蜂巢肺
C. 常會轉移至腎上腺
D. 咳血，呼吸困難

正確答案：B. 形成蜂巢肺